35 歲男性，出現咳嗽與咳血，下肢出現多個紫紅色壓痛結節，下列何項檢查最有助於診斷 Wegener's  granulomatosis？
A. antihistone antibodies
B. antiproteinase-3 antineutrophil cytoplasmic antibodies（PR3-ANCA）
C. anticardiolipin antibodies
D. antinuclear antibodies（ANA）

正確答案：B. antiproteinase-3 antineutrophil cytoplasmic antibodies（PR3-ANCA）